Subject with a history of loss of vision because of non-arteritic anterior ischemic optic neuropathy (NAION), history of temporary or permanent loss of vision, including unilateral loss of vision

The above is a clinical trial exclusion criterion. Annotated with entity spans:
Subject with a [Temporal: history of] [Condition: loss of vision] because of [Condition: non-arteritic anterior ischemic optic neuropathy] ([Condition: NAION]), history of [Qualifier: temporary] or [Qualifier: permanent] [Condition: loss of vision], including [Qualifier: unilateral] [Condition: loss of vision]